Known or suspected congenital or acquired immunodeficiency; or receipt of immunosuppressive therapy, such as anti-cancer chemotherapy or radiation therapy, within the preceding 6 months; or long-term systemic corticosteroid therapy (prednisone or equivalent for more than 2 consecutive weeks within the past 3 months)

The above is a clinical trial exclusion criterion. Annotated with entity spans:
[Observation: Known] or [Observation: suspected] [Condition: congenital] or [Condition: acquired immunodeficiency]; or receipt of [Procedure: immunosuppressive therapy], such as [Procedure: anti-cancer chemotherapy] or [Procedure: radiation therapy], [Temporal: within the preceding 6 months]; or [Multiplier: long-term] [Procedure: systemic corticosteroid therapy] ([Drug: prednisone] or equivalent [Temporal: for more than 2 consecutive weeks] [Temporal: within the past 3 months])